Clinical trial inclusion criterion:
Histologically confirmed primary breast cancer

Annotated entities:
- Condition: "primary breast cancer"
- Qualifier: "Histologically confirmed"
- Procedure: "Histologically"